angiographic stenosis>50% or occlusion of at least one tibial vessel of at least 40mm for which an interventional treatment is scheduled

The above is a clinical trial inclusion criterion. Annotated with entity spans:
[Measurement: angiographic stenosis][Value: >50%] or [Condition: occlusion] of [Multiplier: at least one] [Qualifier: tibial vessel] of [Qualifier: at least 40mm] for which an [Procedure: interventional treatment] is [Mood: scheduled]